Which graph database is used by the Reactome graph database?

The Reactome graph database organizes data and annotations (called tracks) around the reference sequences or draft assemblies of many eukaryotic biomolecular pathways and presents them using a powerful web-based graphical interface. The data are stored in a relational database, Neo4j, which is updated regularly with the addition of new data and corrections to previous data.